Clinical trial exclusion criterion:
Having anaphylactic reaction for Rosuvastatin;

Annotated entities:
- Condition: "anaphylactic reaction"
- Drug: "Rosuvastatin"